Clinical trial exclusion criterion:
Significant GI disease, previous major gastric/bowel surgery, difficulty swallowing or malabsorption syndrome.

Annotated entities:
- Condition: "GI disease"
- Qualifier: "Significant"
- Subjective_judgement: "Significant"
- Procedure: "bowel surgery"
- Procedure: "gastric surgery"
- Qualifier: "major"
- Subjective_judgement: "major"
- Condition: "difficulty swallowing"
- Condition: "malabsorption syndrome"